Clinical trial inclusion criteria:
DSM-IV-TR major depressive disorder
aged between 20 and 80
durg-naive or drug-free

Annotated entities:
- Qualifier: "DSM-IV-TR"
- Condition: "major depressive disorder"
- Person: "aged"
- Value: "between 20 and 80"
- Drug: "durg"
- Negation: "naive"
- Drug: "drug"
- Negation: "free"